Clinical trial inclusion criterion:
Normal cognitive function in order to sign written, informed consent and to understand trial protocol

Entity relations:
- Has_value("cognitive function", "Normal")